Clinical trial exclusion criteria:
Inability to give informed consent
Pregnancy
Concurrent antibiotherapy
Certain infectious endocarditis
Concurrent anti-inflammatory therapy, including corticosteroid therapy

Annotated entities:
- Informed_consent: "Inability to give informed consent"
- Condition: "Pregnancy"
- Drug: "antibiotherapy"
- Temporal: "Concurrent"
- Condition: "infectious endocarditis"
- Qualifier: "Certain"
- Temporal: "Concurrent"
- Procedure: "anti-inflammatory therapy"
- Drug: "anti-inflammatory"
- Procedure: "corticosteroid therapy"
- Drug: "corticosteroid"